Inability to give informed consent

The above is a clinical trial exclusion criterion. Annotated with entity spans:
[Post-eligibility: Inability to give informed consent]